Clinical trial inclusion criterion:
Uncomplicated RYGB performed minimum 3 months prior to the study.

Entity relations:
- Has_qualifier("RYGB", "Uncomplicated")
- Has_index("minimum 3 months prior to the study", "the study")
- Has_temporal("RYGB", "minimum 3 months prior to the study")